下列何者為肺最常見的良性腫瘤？
A. lipoma
B. leiomyoma
C. hamartoma
D. papilloma

正確答案：C. hamartoma